Clinical trial exclusion criterion:
17. Subject with life expectancy less than 6 months as assessed by investigators;

Entity relations:
- Has_value("life expectancy", "less than 6 months")